Wallenberg's 症候群最常發生於下列那一條動脈阻塞？
A. Middle cerebral artery
B. Anterior inferior cerebellar artery
C. Posterior inferior cerebellar artery
D. Superior cerebellar artery

正確答案：C. Posterior inferior cerebellar artery